Clinical trial exclusion criterion:
Children in care: Children who are wards of the government or state are not eligible for participation in this study.

Annotated entities:
- Context_Error: "Children in care: Children who are wards of the government or state are not eligible for participation in this study"
- Non-query-able: "Children in care: Children who are wards of the government or state are not eligible for participation in this study"